Clinical trial exclusion criterion:
Patients who require endotracheal intubation without sedative medication. For example, patients in full cardiac arrest.

Entity relations:
- Has_context("endotracheal intubation", "require")
- Has_negation("sedative medication", "without")
- AND("endotracheal intubation", "sedative medication")